Clinical trial exclusion criterion:
The patients have active infections that were not suitable for chemotherapy;

Entity relations:
- Has_negation("suitable for chemotherapy", "not")
- Has_qualifier("infections", "suitable for chemotherapy")
- Has_temporal("infections", "active")